Describe PWMScan

PWMScan is a fast web-based tool to scan server- resident genomes for matches to a user-suppressor PWM or transcription factor binding site model from a public database.